Hepatic dysfunction with increased bleeding risk

The above is a clinical trial exclusion criterion. Annotated with entity spans:
[Condition: Hepatic dysfunction] with [Qualifier: increased] [Observation: bleeding risk]